Clinical trial inclusion criterion:
aged between 3 - 36 months

Entity relations:
- Has_value("aged", "between 3 - 36 months")